有關脊椎損傷，下列何者錯誤？
A. 只要下肢仍有感覺就屬於不完全性的損傷
B. Central cord syndrome指病人理學檢查時上肢比下肢無力
C. Brown-Séquard syndrome指對側運動功能及對側感覺功能喪失
D. Anterior cord syndrome指下肢無力及對痛和溫度的感覺喪失

正確答案：C. Brown-Séquard syndrome指對側運動功能及對側感覺功能喪失